4. MMSE score ≥ 20

The above is a clinical trial inclusion criterion. Annotated with entity spans:
4. [Measurement: MMSE] [Value: score ≥ 20]